Clinical trial inclusion criterion:
5. Volunteers must be willing to complete all study-related activities

Annotated entities:
- Parsing_Error: "5."
- Post-eligibility: "Volunteers must be willing to complete all study-related activities"
- Non-query-able: "Volunteers must be willing to complete all study-related activities"